視網膜（retina）含有光感受器（photoreceptor）及神經細胞，有些病人的視力缺損是由於視網膜的第一及第二層剝離（retinal detachment）。下列有關視網膜的敘述何者錯誤？
A. 視網膜的第一層（layer I）為色素上皮（pigment epithelium）
B. 桿狀細胞（rods）比椎狀細胞（cones）含有更多的光色素（photopigment）
C. 雙極細胞（bipolar cells）的軸突（axons）形成視神經纖維層（optic fiber layer）
D. 光色素（photopigment）的製造主要在光感受細胞的內節（inner segment of photoreceptor cells）完成

正確答案：C. 雙極細胞（bipolar cells）的軸突（axons）形成視神經纖維層（optic fiber layer）